El término “corrección” (o edición) del RNA se refiere a:
1. El proceso de autocorrección del RNA sintetizado por la RNA Polimerasa.
2. El proceso de corte y empalme de los intrones.
3. El proceso de maduración de los extremos 5´ y 3´ del RNA.
4. El cambio en la secuencia nucleotídica del RNA tras la transcripción que no obedece a un proceso de maduración.
5. El proceso de reparación de errores en el DNA que se va a transcribir.

Respuesta correcta: 4. El cambio en la secuencia nucleotídica del RNA tras la transcripción que no obedece a un proceso de maduración.